Clinical trial exclusion criterion:
Use of prohibited medications, in particular, agents known to be nephrotoxic or drugs slow in renal excretion.

Entity relations:
- Has_qualifier("agents", "nephrotoxic")
- Has_qualifier("drugs", "slow in renal excretion")
- OR("agents", "drugs")